精子的生成過程（spermatogenesis）需經過減數分裂（meiosis）。有關減數分裂的敘述，下列何者最正確？
A. 同源染色體（homologous chromosome）聯會（synapsis）可發生於減數分裂及有絲分裂（mitosis）時
B. 同源染色體聯會之後會發生同源片段的遺傳物質互換（crossing over）
C. 性染色體（sex chromosome）X 和 Y 由於大小相差太大，無法發生如體染色體（autosome）一樣的同源染色體聯會
D. 第一次減數分裂（meiosis I）是著絲粒（centromere）分離，同源染色體並不分離

正確答案：B. 同源染色體聯會之後會發生同源片段的遺傳物質互換（crossing over）